Clinical trial exclusion criterion:
Patients with brain metastases or any history of brain metastases

Entity relations:
- Has_temporal("brain metastases", "history")
- OR("brain metastases", "brain metastases")